手術傷及下列何者最可能切斷卵巢動脈？
A. 懸韌帶（suspensory ligament）
B. 薦棘韌帶（sacrospinous ligament）
C. 主韌帶（cardinal ligament）
D. 卵巢圓韌帶（ovarian ligament）

正確答案：A. 懸韌帶（suspensory ligament）